previous unusual response to esmolol

The above is a clinical trial exclusion criterion. Annotated with entity spans:
previous [Condition: unusual response] to [Drug: esmolol]